Patients < 18 years of age and >70 years of age

The above is a clinical trial exclusion criterion. Annotated with entity spans:
Patients [Value: < 18 years] of [Person: age] and [Value: >70 years] of [Person: age]